下列何者並非脈絡叢（choroid plexus）的結構形成物？
A. 平滑肌肉層（smooth muscle layer）
B. 基底膜層（basement membrane）
C. 腦室管膜細胞層（ependymal cells of ventricle）
D. 微血管內皮細胞層（endothelium of capillary）

正確答案：A. 平滑肌肉層（smooth muscle layer）